Clinical trial inclusion criterion:
Patients undergoing robotic-assisted laparoscopic prostatectomy

Annotated entities:
- Procedure: "obotic-assisted laparoscopic prostatectomy"